Clinical trial exclusion criterion:
Uncontrolled hypertension (systolic blood pressure> 180 mm Hg. and / or diastolic blood pressure> 100 mm.hg in patients receiving antihypertensive drugs).

Entity relations:
- Has_value("systolic blood pressure", "> 180 mm Hg")
- Has_value("diastolic blood pressure", "> 100 mm.hg")
- Has_qualifier("hypertension", "Uncontrolled")
- Subsumes("hypertension", "systolic blood pressure")
- Subsumes("hypertension", "antihypertensive drugs")
- OR("systolic blood pressure", "diastolic blood pressure")